The capacity to provide informed consent.

The above is a clinical trial inclusion criterion. Annotated with entity spans:
[Non-query-able: The capacity to provide informed consent.]